What are the major clinical Villefranche criteria for classic Ehlers-Danlos syndrome?

The major clinical Villefranche criteria for classic Ehlers-Danlos syndrome are skin hyperextensibility, dystrophic scarring, and joint hypermobility.